一位 18 歲男性，近年來漸次出現肢體顫抖，步態不穩，構音障礙，在學成績退步，情緒不穩定。身體檢查發現眼角膜有棕綠色的沉澱，上肢有翼跳動震顫（wing beating tremor）合併有肌張力異常的姿勢（dystonic posture）。下列何者是最可能的診斷？
A. 舞蹈棘紅血球症（choreoacanthocytosis）
B. 席登罕氏舞蹈症（Sydenham chorea）
C. 多發性硬化症（multiple sclerosis）
D. 威爾森氏症（Wilson disease）

正確答案：D. 威爾森氏症（Wilson disease）